Clinical trial exclusion criterion:
1. Currently enrolled in another research trial for investigative nutritional or other therapies thought to have an impact on immune system functioning.

Annotated entities:
- Subjective_judgement: "Currently enrolled in another research trial for investigative nutritional or other therapies thought to have an impact on immune system functioning."
- Post-eligibility: "Currently enrolled in another research trial for investigative nutritional or other therapies thought to have an impact on immune system functioning."